Clinical trial exclusion criterion:
4. Have severe liver disease, kidney disease or cancer;

Entity relations:
- Has_qualifier("liver disease", "severe")
- OR("liver disease", "kidney disease", "cancer")